AST < 10 x ULN

The above is a clinical trial inclusion criterion. Annotated with entity spans:
[Measurement: AST] [Value: < 10 x ULN]